Clinical trial inclusion criterion:
Ex-smokers over five years;

Entity relations:
- Has_temporal("Ex-smokers", "over five years")